Clinical trial exclusion criterion:
Subject is pregnant (documented by a positive pregnancy test) or is actively breast-feeding.

Entity relations:
- Has_value("pregnancy test", "positive")
- Has_qualifier("breast-feeding", "actively")
- multi("actively", "actively")
- AND("pregnant", "pregnancy test")
- OR("pregnant", "breast-feeding")